¿Cómo se denominan las glándulas sebáceas de la areola mamaria que se hacen más prominentes durante el embarazo?:
1. Acinos.
2. Tubérculos de Montgomery.
3. Mamilas.
4. Células de Boll.

Respuesta correcta: 2. Tubérculos de Montgomery.